Histological confirmation of relapsed/refractory diffuse large B-cell lymphoma after prior rituximab and anthracycline-containing systemic treatment regimen such as R-CHOP (rituximab, cyclophosphamide, doxorubicin, vincristine, and prednisone), R-EPOCH (rituximab, etoposide phosphate, prednisone, vincristine sulfate, cyclophosphamide, doxorubicin hydrochloride), R-HyperCVAD (rituximab, cyclophosphamide, vincristine sulfate, doxorubicin hydrochloride, dexamethasone) etc.

The above is a clinical trial inclusion criterion. Annotated with entity spans:
[Procedure: Histological] [Value: confirmation] of relapsed/refractory [Qualifier: diffuse] [Qualifier: large] [Condition: B-cell lymphoma] [Temporal: after] [Reference_point: prior rituximab and anthracycline-containing systemic treatment regimen] such as [Drug: R-CHOP] ([Drug: rituximab], [Drug: cyclophosphamide], [Drug: doxorubicin], [Drug: vincristine], and [Drug: prednisone]), [Drug: R-EPOCH] ([Drug: rituximab], [Drug: etoposide phosphate], [Drug: prednisone], [Drug: vincristine sulfate], [Drug: cyclophosphamide], [Drug: doxorubicin hydrochloride]), [Drug: R-HyperCVAD] ([Drug: rituximab], [Drug: cyclophosphamide], [Drug: vincristine sulfate], [Drug: doxorubicin hydrochloride], [Drug: dexamethasone]) etc.